Clinical trial inclusion criterion:
Expected survival = 3 months

Entity relations:
- Has_value("Expected survival", "= 3 months")